Clinical trial exclusion criterion:
acute lower extremity ischemic event secondary to thromboembolic disease or acute trauma,

Annotated entities:
- Qualifier: "acute"
- Qualifier: "lower extremity"
- Condition: "ischemic event"
- Qualifier: "secondary to thromboembolic disease"
- Qualifier: "secondary to acute trauma"
- Condition: "thromboembolic disease"
- Condition: "acute trauma"